Subjects with less than one year duration of Parkinson's

The above is a clinical trial exclusion criterion. Annotated with entity spans:
Subjects with [Multiplier: less than one year duration] of [Condition: Parkinson's]